下列有關一氧化碳中毒之腦部變化，何者錯誤？
A. 大腦皮質第三層及第五層之神經元受損最嚴重
B. 小腦受損最嚴重的細胞為普金奇氏細胞（Purkinje cells）
C. 最常見有雙側殼（putamen）壞死
D. 長期存活的病人，可能會有白質的髓鞘脫失（demyelination）

正確答案：C. 最常見有雙側殼（putamen）壞死